Clinical trial inclusion criterion:
Distal biliary obstruction consistent with pancreatic cancer, distal CBD cholangiocarcinoma or other periampullary malignancy

Annotated entities:
- Condition: "Distal biliary obstruction"
- Condition: "pancreatic cancer"
- Condition: "distal CBD cholangiocarcinoma"
- Condition: "periampullary malignancy"
- Qualifier: "other"